Clinical trial exclusion criterion:
Acute bacterial endocarditis and endocarditis lenta.

Annotated entities:
- Condition: "endocarditis lenta"
- Condition: "Acute bacterial endocarditis"